Dentro de la Evaluación psicológica, los Autorregistros, como estrategia para obtener información, ¿cómo pueden ser considerados?
1. Como un tipo de técnica Experimental.
2. Como un tipo de Autoinformes.
3. Como una modalidad de las técnicas objetivas.
4. Como una técnica Observacional.
5. Como una modalidad del Diferencial Semántico de Osgood.

Respuesta correcta: 2. Como un tipo de Autoinformes.